Hy's law measures failure for what organ?

Hy's law correlates enzyme elevations with liver injury ad subsequent failure.